Pregnant or breast feeding;

The above is a clinical trial exclusion criterion. Annotated with entity spans:
[Pregnancy_considerations: Pregnant or breast feeding];